下列何種輔酶能協助單碳基團（one-carbon groups）轉移，如果缺乏時會影響 DNA 的合成？
A. coenzyme A
B. lipoate
C. tetrahydrofolate
D. pyridoxal phosphate

正確答案：C. tetrahydrofolate